What is the association between maternal and fetal alloantigens and RANTES production?

Maternal tolerance to fetal alloantigens may be induced by RANTES production.